下列何者會引發 migrating myoelectric complex（MMC）的產生？
A. 胃泌素（gastrin）
B. 運動素（motilin）
C. 正腎上腺素（norepinephrine）
D. 腸促胰泌素（secretin）

正確答案：B. 運動素（motilin）